Clinical trial exclusion criterion:
Neutrophil count < 0.5 x 109 cells/L.

Annotated entities:
- Measurement: "Neutrophil count"
- Value: "< 0.5 x 109 cells/L"